If female, willing to use contraception throughout the study

The above is a clinical trial inclusion criterion. Annotated with entity spans:
If [Person: female], willing to use [Procedure: contraception] [Temporal: throughout the study]